Clinical trial exclusion criterion:
6. History of evidence of clinically significant hepatic, cardiac, pulmonary, endocrine, immunological, gastrointestinal, hematological, vascular or collagen disease

Entity relations:
- Has_qualifier("hepatic disease", "clinically significant")
- Has_temporal("hepatic disease", "History")
- OR("hepatic disease", "vascular disease", "hematological disease", "gastrointestinal disease", "immunological disease", "endocrine disease", "pulmonary disease", "cardiac disease", "collagen disease")